Clinical trial inclusion criterion:
Heart rate 55-100 beats per minute

Annotated entities:
- Measurement: "Heart rate"
- Value: "55-100 beats per minute"